關於開放性骨折（open fracture），下列敘述何者錯誤？
A. 依據 Gustilo-Anderson 的分類，骨折處傷口大於 10 公分，同時合併嚴重軟組織及血管損傷時，屬於第 II 型開放性骨折（type II open fracture）
B. 開放性骨折（open fracture）的病人送達急診室時，應立即投予適當的抗生素治療
C. 較大傷口的開放性骨折（open fracture）應儘速至手術室中進行徹底的清洗及清創，不建議在急診室進行傷口探查（exploration of the wounds）
D. 第 I 型開放性骨折（type I open fracture）的傷口通常可進行初級縫合（primary closure）；第 III 型開放性骨折（type III open fracture）的傷口則不應進行初級縫合（primary closure）

正確答案：A. 依據 Gustilo-Anderson 的分類，骨折處傷口大於 10 公分，同時合併嚴重軟組織及血管損傷時，屬於第 II 型開放性骨折（type II open fracture）